Clinical trial exclusion criteria:
preexisting pectoral, axillar, thoracic homolateral pain
habitual opioid consumption;
drug-alcoholics addiction ;
ICU postoperative recovery;
kidney failure (creatinin > 2 g/dl, creatinin <clearance 30 ml/h) and/or hepatic failure (cholinesterase < 2000 UI);
cardiac arrhythmias o;
Epilepsy;
Psychiatric, cognitive disorders, mental retardation;
Coagulopathies (INR > 2, activated partial thromboplastin time - aPTT>44 sec);
platelet count less than 100.000/mm3;
BMI > 30;
Allergies to study drugs.

Annotated entities:
- Condition: "thoracic pain"
- Qualifier: "homolateral"
- Condition: "axillar pain"
- Condition: "pectoral pain"
- Observation: "opioid consumption"
- Qualifier: "habitual"
- Condition: "alcoholics addiction"
- Condition: "addiction drug"
- Observation: "ICU postoperative recovery"
- Condition: "kidney failure"
- Measurement: "creatinin"
- Measurement: "creatinin <clearance"
- Value: "30 ml/h"
- Value: "> 2 g/dl"
- Condition: "hepatic failure"
- Measurement: "cholinesterase"
- Value: "< 2000 UI"
- Condition: "cardiac arrhythmias"
- Condition: "Epilepsy"
- Condition: "Psychiatric, cognitive disorders"
- Condition: "mental retardation"
- Condition: "Coagulopathies"
- Measurement: "INR"
- Value: "> 2"
- Measurement: "activated partial thromboplastin time - aPTT"
- Value: ">44 sec"
- Measurement: "platelet count"
- Value: "less than 100.000/mm3"
- Measurement: "BMI"
- Value: "> 30"
- Condition: "Allergies"
- Drug: "study drugs"